Clinical trial exclusion criterion:
recurrent contracture in the finger to be treated

Annotated entities:
- Condition: "contracture"
- Qualifier: "finger to be treated"
- Qualifier: "recurrent"